Clinical trial exclusion criterion:
Patients with placenta pathology such as praevia, acreta, pre-eclampsia

Annotated entities:
- Condition: "placenta pathology"
- Condition: "praevia"
- Condition: "acreta"
- Condition: "pre-eclampsia"